Clinical trial exclusion criterion:
Previous enrollment in this study

Annotated entities:
- Competing_trial: "Previous enrollment in this study"